What is the function of a protein kinase?

Protein kinases are enzymes that add a phosphate (PO4) group to a protein, and can modulate its function.